Current pregnancy;

The above is a clinical trial exclusion criterion. Annotated with entity spans:
[Temporal: Current] [Condition: pregnancy];